下列何者不是生長激素（growth hormone）在臨床上可使用的適應症？
A. 普拉德－威利症（Prader-Willi syndrome）
B. 透納氏症（Turner syndrome）
C. 短腸症（short bowel syndrome）
D. 腕隧道症候群（carpal tunnel syndrome）

正確答案：D. 腕隧道症候群（carpal tunnel syndrome）